Clinical trial inclusion criterion:
Emergent/elective

Annotated entities:
- Qualifier: "Emergent"
- Qualifier: "elective"